Clinical trial exclusion criterion:
Subject has insulin-dependent diabetes mellitus.

Entity relations:
- Has_qualifier("diabetes mellitus", "insulin-dependent")